Which disease is diagnosed using the Finkelstein's test?

Finkelstein's test is the classic diagnostic test for de Quervain's disease.